下列何項與 B 型肝炎疫苗接種失敗無關？
A. 肥胖者
B. 新生兒
C. 老年人
D. 免疫缺陷者

正確答案：B. 新生兒